Clinical trial exclusion criterion:
Subjects with a supine BP >140 mm Hg systolic or >90 mm Hg diastolic or <100 mm Hg systolic or <60 mm Hg diastolic based on the average of the triplicate

Entity relations:
- Has_value("supine BP", ">140 mm Hg systolic")
- OR(">140 mm Hg systolic", "<100 mm Hg systolic", "<60 mm Hg diastolic", ">90 mm Hg diastolic")